Clinical trial inclusion criterion:
Monitoring of intracranial temperature and pressure by intraparenchymal sensor (Sophysa®)

Entity relations:
- Subsumes("intraparenchymal sensor", "Sophysa®")
- AND("intracranial temperature", "intraparenchymal sensor")
- OR("intracranial temperature", "intracranial pressure")